Confirmation of glenohumeral OA via imaging

The above is a clinical trial inclusion criterion. Annotated with entity spans:
Confirmation of [Condition: glenohumeral OA] via [Procedure: imaging]